Previous treatment with cytotoxic agents or high-dose steroids

The above is a clinical trial exclusion criterion. Annotated with entity spans:
[Temporal: Previous] [Procedure: treatment] with [Drug: cytotoxic agents] or [Drug: high-dose steroids]